Clinical trial exclusion criterion:
10. Severe anemia (hemoglobin <8 g/dL)

Entity relations:
- Has_value("hemoglobin", "<8 g/dL")
- Subsumes("Severe", "hemoglobin")
- Has_qualifier("anemia", "Severe")